Clinical trial inclusion criterion:
18-80 years

Annotated entities:
- Person: "years"
- Value: "18-80"